Clinical trial exclusion criterion:
uncontrolled hypertension (treated systolic blood pressure > 155 mmHg or diastolic blood pressure > 95 mmHg)

Annotated entities:
- Condition: "hypertension"
- Qualifier: "uncontrolled"
- Measurement: "systolic blood pressure"
- Qualifier: "treated"
- Value: "> 155 mmHg"
- Measurement: "diastolic blood pressure"
- Value: "> 95 mmHg"